Clinical trial exclusion criterion:
Intake of disallowed medications including(but not limited to):

Annotated entities:
- Drug: "disallowed medications"
- Parsing_Error: "Intake of disallowed medications including(but not limited to):"